History or known presence of infectious causes of myelopathy (e.g., syphilis, Lyme disease, human T-lymphotropic virus 1 (HTLV-1), herpes zoster myelopathy)

The above is a clinical trial exclusion criterion. Annotated with entity spans:
History or known presence of [Condition: infectious causes] of [Condition: myelopathy] (e.g., [Condition: syphilis], [Condition: Lyme disease], [Condition: human T-lymphotropic virus 1 (HTLV-1)], [Condition: herpes zoster myelopathy])